Clinical trial inclusion criterion:
mild gastrointestinal symptom

Entity relations:
- Has_qualifier("gastrointestinal symptom", "mild")